Clinical trial exclusion criterion:
Patients with neuromuscular or neurosensory deficiency, which would limit the ability to assess pain levels

Annotated entities:
- Condition: "neuromuscular deficiency"
- Condition: "neurosensory deficiency"